下列有關退化性老年癡呆症（Alzheimer's disease）的描述，何者錯誤？
A. 退化性老年癡呆症病人其前腦（basal forebrain）的膽鹼性（cholinergic）神經元有退化現象
B. 退化性老年癡呆症病人的大腦皮質（cerebral cortex）及海馬迴（hippocampus）區域經常可以發現類澱粉斑（amyloid plaques）的出現
C. 臨床上可以使用乙醯膽鹼酯酶（Acetylcholinesterase）抑制劑來緩解其認知異常的症狀，但經常會出現病人血壓上升的副作用
D. Memantine 為一種 N-methyl-D-aspartate 受體的阻斷劑，對於退化性老年癡呆症病人也具有治療的效果

正確答案：C. 臨床上可以使用乙醯膽鹼酯酶（Acetylcholinesterase）抑制劑來緩解其認知異常的症狀，但經常會出現病人血壓上升的副作用